Clinical trial exclusion criteria:
Current or recent infection
Clinically significant laboratory abnormalities
Pregnancy

Annotated entities:
- Temporal: "recent"
- Temporal: "Current"
- Condition: "infection"
- Qualifier: "Clinically significant"
- Condition: "laboratory abnormalities"
- Procedure: "laboratory"
- Condition: "Pregnancy"